What is the prevalence of the inactivating AKT variant p.Pro50Thr in the Finnish population?

The P.Pro50Thr allele is present at 1.1% frequency in Finns but virtually absent in other ancestries.